Clinical trial inclusion criterion:
Duration of SCI =1 year;

Annotated entities:
- Condition: "SCI"
- Temporal: "=1 year"